Patients having earned more than 4500€ in indemnities for participation in clinical trials during the previous 12 months, including this study.

The above is a clinical trial exclusion criterion. Annotated with entity spans:
Patients having [Observation: earned more than 4500€ in indemnities] for [Competing_trial: participation in clinical trials] [Temporal: during the previous 12 months], including this study.